下列何者不是髂內動脈（internal iliac artery）的分支？
A. 閉孔動脈
B. 直腸上動脈
C. 直腸中動脈
D. 陰部內動脈

正確答案：B. 直腸上動脈